引起染髮劑皮膚炎（hair dye dermatitis）最常見的過敏原為：
A. 香水（fragrance mix）
B. 鎳（nickel）
C. 對次酚二胺（para-phenylenediamine, PPD）
D. 鉻酸鹽（chromate）

正確答案：C. 對次酚二胺（para-phenylenediamine, PPD）